Clinical trial inclusion criterion:
a single or dual chamber MRI conditional pacemaker (BSCI) or

Entity relations:
- Has_qualifier("pacemaker", "single chamber")
- Subsumes("pacemaker", "BSCI")
- Has_qualifier("pacemaker", "MRI conditional")
- OR("single chamber", "dual chamber")